Clinical trial inclusion criterion:
Physical examination at screening period without clinically significant changes;

Entity relations:
- Has_index("at screening period", "screening period")